Clinical trial exclusion criterion:
5. history of surgery on the Achilles tendon or systemic diseases (general inflammatory diseases such as rheumatologic disorders and diabetes)

Annotated entities:
- Temporal: "history"
- Procedure: "surgery on the Achilles tendon"
- Condition: "systemic diseases"
- Condition: "general inflammatory diseases"
- Condition: "rheumatologic disorders"
- Condition: "diabetes"